Clinical trial exclusion criterion:
History of curettage or other intrauterine surgery

Entity relations:
- Subsumes("intrauterine surgery", "curettage")
- Has_temporal("intrauterine surgery", "History")